關於罹患注意力不足過動症的個案，下列何者錯誤？
A. 注意力無法集中，以致無法完成該做的作業或工作
B. 自尊程度常比一般兒童青少年要高
C. 衝動控制不佳，容易動怒或發脾氣
D. 面對問題時沒耐心思考解決之道，提前放棄，缺乏組織和解決技巧

正確答案：B. 自尊程度常比一般兒童青少年要高